¿Cuál es la principal utilidad del hidruro de aluminio y litio en Química Orgánica?:
1. Es un agente oxidante.
2. Es un agente reductor.
3. Es un compuesto ácido.
4. Es un reactivo organometálico.

Respuesta correcta: 2. Es un agente reductor.